Clinical trial exclusion criterion:
Subjects (females) with active sexual life that do not use a contraceptive method.

Entity relations:
- Has_negation("contraceptive method", "not")